Clinical trial inclusion criterion:
Lower left ventricular ejection fraction 45% (LVEF <45%) assessed by simple and recent echocardiogram;

Annotated entities:
- Measurement: "Lower left ventricular ejection fraction"
- Value: "45%"
- Measurement: "LVEF"
- Value: "<45%"
- Procedure: "echocardiogram"
- Temporal: "recent"